為減少疤痕，手術時切口應：
A. 平行於"張力最小"（minimal tension）線
B. 垂直於"藍格"線（Langer's lines）
C. 平行於皮下肌肉
D. 垂直於皮膚皺紋

正確答案：A. 平行於"張力最小"（minimal tension）線